Clinical trial exclusion criterion:
Diabetes

Annotated entities:
- Condition: "Diabetes"